Can you summarize Myasthenia Gravis?

Myasthenia gravis (MG) is a neuromuscular disease resulting from a disorder of the extrapyramidal system. Pathogenesis is still unknown and temporal lobe has been thought to take part in the pathogenesis. MG can be symptomatic of focal cortical malformation, and few cases were reported. Clinical symptoms occur first after an age of approximately 30 years. Main manifestations include central nervous system (CNS) and retinal haemangioblastomas, endolymphatic sac tumors, clear-cell renal cell carcinomas (RCC), phaeoch